What drug, used to treat rheumatoid arthritis, is an interleukin-1 receptor antagonist?

Anakinra is an anti-IL-1RA targeting IL-1β with a central role in the occurrence of auto-inflammatory diseases like rheumatoid arthritis.